Any diseases may limit the efficacy or safety of the study;

The above is a clinical trial exclusion criterion. Annotated with entity spans:
[Non-query-able: Any diseases may limit the efficacy or safety of the study];